Clinical trial exclusion criterion:
Concurrent enrollment in an investigational study evaluating another device, biologic, or drug.

Annotated entities:
- Competing_trial: "Concurrent enrollment in an investigational study evaluating another device, biologic, or drug."